Clinical trial inclusion criterion:
Serum bilirubin: ≤ 1.2 mg/dL

Annotated entities:
- Measurement: "Serum bilirubin"
- Value: "≤ 1.2 mg/dL"